Clinical trial exclusion criterion:
Unwilling or unable to complete the patient reported outcome (PRO) questionnaires

Annotated entities:
- Non-representable: "Unwilling or unable to complete the patient reported outcome (PRO) questionnaires"